一位 25 歲年輕男性，日前因呼吸困難至醫院就醫，檢查後發現患者右上肺葉的肺泡破裂，肋膜腔（pleural space）堆積大量的空氣，經診斷為自發性氣胸（pneumothorax），下列何者並不會出現於此病患？
A. 肋膜內壓（intrapleural pressure）為正壓
B. 功能性肺餘容量（functional residual capacity）增加
C. 肺活量（vital capacity）下降
D. 缺氧性缺氧（hypoxic hypoxia）

正確答案：B. 功能性肺餘容量（functional residual capacity）增加